As of September 2018, what machine learning algorithm is used to for cardiac arrhythmia detection from a  short single-lead ECG recorded by a wearable device?

SVM approach for cardiac arrhythmias detection in short single-lead ECG recorded by a wearable device